Clinical trial inclusion criterion:
female subjects of childbearing potential must have a negative pregnancy test.

Annotated entities:
- Measurement: "pregnancy test"
- Value: "negative"
- Condition: "childbearing potential"
- Person: "female"